Clinical trial exclusion criterion:
Neurodegenerative disorders (i.e. Parkinson disease. LBD, or FTD).

Entity relations:
- Subsumes("Neurodegenerative disorders", "Parkinson disease")
- OR("Parkinson disease", "FTD", "LBD")